關於乾眼症的敘述，下列何者正確？
A. 淚膜裂解時間（tear film break-up time）主要是測淚水的穩定度，高於10秒屬異常
B. 淚水層缺少之乾眼症病患，若有角膜點狀上皮糜爛（punctate epithelial erosion），容易出現在位於瞼間裂
C. 乾眼症會造成眼睛不舒適感，但並不會對視覺品質造成影響
D. 當乾眼症伴隨嚴重發炎時，最好使用淚點栓塞（punctum plug）減少淚水的流失，不可使用類固醇藥水

正確答案：B. 淚水層缺少之乾眼症病患，若有角膜點狀上皮糜爛（punctate epithelial erosion），容易出現在位於瞼間裂